Clinical trial exclusion criterion:
Unable to undergo MRI

Entity relations:
- AND("Unable to undergo", "MRI")